2. type 1 diabetes;

The above is a clinical trial exclusion criterion. Annotated with entity spans:
2. [Condition: type 1 diabetes];